Clinical trial inclusion criterion:
Montreal classification: no limitation, except age> 6.

Annotated entities:
- Non-representable: "Montreal classification: no limitation, except age> 6."